Clinical trial exclusion criterion:
Previous antispastic drugs

Entity relations:
- Has_temporal("antispastic drugs", "Previous")